孕婦因大量出血而導致急性呼吸窘迫症候群時，下列處置何者最能增加組織的血氧量？
A. 輸血
B. 分娩
C. 增加動脈氧分壓至200 mmHg
D. 置入肺動脈導管

正確答案：A. 輸血